一位 17 歲男性，發生頭部外傷和左肘部骨折脫位，經整復肘關節後以石膏固定，2 個月後發現肘部腫脹消退，但在肘部前方出現一個硬塊，施行 X 光檢查發現一塊骨化的團塊，經診斷為 myositis ossificans，此時其處理的方式，下列何者正確？
A. 施行積極推拿和伸展，以期改善關節運動範圍
B. 使用固定板保護關節，並施行溫和復健
C. 應在早期施行切除手術
D. 藥物 Indocid 或輻射治療會加重病況

正確答案：B. 使用固定板保護關節，並施行溫和復健